Patients with poorly controlled major psychiatric pathology.

The above is a clinical trial exclusion criterion. Annotated with entity spans:
Patients with [Qualifier: poorly controlled] [Qualifier: major] [Condition: psychiatric pathology].